Clinical trial exclusion criteria:
Emergency surgery needed
Bowel obstruction
Colonoscopy scheduled to be undertaken peroperatively
Other reason indicating mechanical preparation or contradicting it
Allergy to used drugs (PEG, neomycin, metronidazole)

Annotated entities:
- Procedure: "Emergency surgery"
- Mood: "needed"
- Condition: "Bowel obstruction"
- Procedure: "Colonoscopy"
- Temporal: "peroperatively"
- Mood: "scheduled"
- Procedure: "undertaken"
- Procedure: "mechanical preparation"
- Condition: "contradicting"
- Drug: "drugs"
- Condition: "Allergy"
- Drug: "PEG"
- Drug: "neomycin"
- Drug: "metronidazole"